下列惡性腫瘤中何者較少見淋巴結節之轉移？
A. 腺癌（adenocarcinoma）
B. 肉瘤（sarcomas）
C. 黑色素瘤（melanoma）
D. 胚細胞腫瘤（germ cell tumor）

正確答案：B. 肉瘤（sarcomas）